Clinical trial exclusion criterion:
No current treatment plan at OHSU

Entity relations:
- Has_negation("treatment plan", "No")
- Has_temporal("treatment plan", "current")
- AND("treatment plan", "OHSU")